Which R packages have been developed for the discovery of mutational signatures in cancer?

SomaticSignatures: inferring mutational signatures from single-nucleotide variants.Mutational signatures are patterns in the occurrence of somatic single-nucleotide variants that can reflect underlying mutational processes.The SomaticSignatures package provides flexible, interoperable and easy-to-use tools that identify such signatures in cancer sequencing data.It facilitates large-scale, cross-dataset estimation of mutational signatures, implements existing methods for pattern decomposition, supports extension through user-defined approaches and integrates with existing Bioconductor workflows.AVAILABILITY AND IMPLEMENTATION: The R package SomaticSignatures is available as part of the Bioconductor project.Its documentation provides additional details on the methods and demonstrates applications to biological datasets.These mutagenic processes often produce characteristic mutational patterns called mutational signatures.The decomposition of a cancer genome's mutation catalog into mutations consistent with such signatures can provide valuable information about cancer etiology.Hence, one needs to be able to not only decompose a patient's mutational profile into signatures but also establish the accuracy of such decomposition.Results: We proposed two complementary ways of measuring confidence and stability of decomposition results and applied them to analyze mutational signatures in breast cancer genomes.